阻塞性黃疸（obstructive jaundice）常見的病因不包括下列何者？
A. 膽道結石
B. 壺腹部癌症（ampulla of Vater cancer）
C. 胰臟頭部腫瘤
D. 急性A型肝炎

正確答案：D. 急性A型肝炎